Clinical trial exclusion criterion:
Recent unintentional weight change (+/- 10 lbs. in the last 12 months)

Annotated entities:
- Measurement: "weight"
- Value: "+/- 10 lbs."
- Temporal: "last 12 months"